No contraindication for Pregabalin use

The above is a clinical trial inclusion criterion. Annotated with entity spans:
[Negation: No] [Condition: contraindication] for [Drug: Pregabalin] use